Willing to attend study sessions and follow other study protocol

The above is a clinical trial inclusion criterion. Annotated with entity spans:
[Post-eligibility: Willing to attend study sessions and follow other study protocol]